Cardiovascular disease:

The above is a clinical trial inclusion criterion. Annotated with entity spans:
[Parsing_Error: Cardiovascular disease:]